Clinical trial exclusion criterion:
7. Known allergy to rice, rice bran, or related food products.

Annotated entities:
- Condition: "allergy to rice"
- Drug: "rice"
- Condition: "allergy to rice bran"
- Drug: "rice bran"
- Undefined_semantics: "related food products"